Clinical trial inclusion criteria:
Written informed consent prior to beginning specific protocol procedures, including expected cooperation of the patients for the treatment and follow-up, willingness and ability to complete collection of data via wearable device and study mobile must be obtained and documented according to the local regulatory requirements.
Female or male patients.
Age = 18 years old.
Metastatic invasive hormone receptor positive and HER2 negative breast cancer (histologically confirmed).
Patients who in the opinion of the treating physician are candidates suitable for randomization for mono-chemotherapy treatment, that has either an approved label in Europe and/or is supported by guidelines for the treatment of first-line advanced BC, which are based on evidence on safety and efficacy in this setting.
Symptomatic or asymptomatic metastatic breast cancer.
Resolution of all acute toxic effects of prior anti-cancer therapy or surgical procedures to NCI CTCAE version 4.0 grade = 1 (except alopecia or other toxicities not considered a safety risk for the patient at investigator's discretion).
Life-expectancy > 6 months.
For female patients: The patients need to be either A) of non-childbearing potential (documented postmenopausal or post hysterectomy) B) childbearing potential with negative serum or urinary pregnancy test (in this case patients need to use highly effective non-hormonal contraceptive methods).

Annotated entities:
- Non-query-able: "Written informed consent prior to beginning specific protocol procedures, including expected cooperation of the patients for the treatment and follow-up, willingness and ability to complete collection of data via wearable device and study mobile must be obtained and documented according to the local regulatory requirements"
- Person: "Female"
- Person: "male"
- Person: "Age"
- Value: "= 18 years old"
- Condition: "breast cancer"
- Qualifier: "invasive"
- Qualifier: "Metastatic"
- Qualifier: "hormone receptor positive"
- Qualifier: "HER2 negative"
- Non-query-able: "histologically confirmed"
- Non-query-able: "Patients who in the opinion of the treating physician are candidates suitable for randomization for mono-chemotherapy treatment, that has either an approved label in Europe and/or is supported by guidelines for the treatment of first-line advanced BC, which are based on evidence on safety and efficacy in this setting."
- Condition: "metastatic breast cancer"
- Qualifier: "asymptomatic"
- Qualifier: "Symptomatic"
- Measurement: "NCI CTCAE version 4.0"
- Value: "grade = 1"
- Observation: "Resolution"
- Condition: "acute toxic effects"
- Procedure: "anti-cancer therapy"
- Procedure: "surgical procedure"
- Qualifier: "prior"
- Negation: "except"
- Condition: "alopecia"
- Non-query-able: "except alopecia or other toxicities not considered a safety risk for the patient at investigator's discretion)"
- Observation: "Life-expectancy"
- Value: "> 6 months"
- Pregnancy_considerations: "or female patients: The patients need to be either A) of non-childbearing potential (documented postmenopausal or post hysterectomy) B) childbearing potential with negative serum or urinary pregnancy test (in this case patients need to use highly effective non-hormonal contraceptive methods)."